Clinical trial exclusion criterion:
Immunocompromised patients:

Annotated entities:
- Condition: "Immunocompromised"